Clinical trial exclusion criterion:
Unstable and advanced liver disease (as defined by the presence of at least one of the following: ascites, encephalopathy, coagulopathy, hypoalbuminemia, esophageal or gastric varices, or persistent jaundice)

Entity relations:
- Has_qualifier("liver disease", "advanced")
- Has_qualifier("liver disease", "Unstable")
- Has_qualifier("jaundice", "persistent")
- Has_multiplier("ascites", "at least one")
- Subsumes("liver disease", "ascites")
- OR("ascites", "esophageal varices", "gastric varices", "hypoalbuminemia", "coagulopathy", "encephalopathy", "jaundice")